Clinical trial exclusion criterion:
Patients with cardiogenic shock - Killip Class 4

Annotated entities:
- Condition: "cardiogenic shock"
- Measurement: "Killip Class"
- Value: "4"